Clinical trial exclusion criterion:
Ongoing participation in a prior clinical study at the time of screening.

Annotated entities:
- Context_Error: "Ongoing participation in a prior clinical study at the time of screening."
- Non-query-able: "Ongoing participation in a prior clinical study at the time of screening."